有關胚胎植入前基因診斷（preimplantation genetic diagnosis）技術的敘述，下列何者錯誤？
A. 須要配合試管嬰兒療程施行
B. 當結果是正常女性（46, XX）時，最有可能是培養處理時，母親細胞污染所造成
C. 可排除染色體異常的胚胎
D. 當婦女有習慣性流產的病史，可減少流產的機會

正確答案：B. 當結果是正常女性（46, XX）時，最有可能是培養處理時，母親細胞污染所造成